Clinical trial exclusion criterion:
diagnosis of chronic pain

Annotated entities:
- Condition: "chronic pain"